El “Test del Marco y la Varilla” es más propiamente una técnica de evaluación:
1. Objetiva.
2. Táctil.
3. Proyectiva.
4. Auditiva.

Respuesta correcta: 1. Objetiva.